Primary knee osteoarthritis diagnosed using the American College of Rheumatology criteria (46)

The above is a clinical trial inclusion criterion. Annotated with entity spans:
[Condition: Primary knee osteoarthritis] diagnosed using the [Qualifier: American College of Rheumatology criteria] (46)